Clinical trial inclusion criterion:
Remains hospitalized after birth (has never been discharged home)

Entity relations:
- Has_index("after birth", "birth")
- Has_temporal("hospitalized", "after birth")